Clinical trial exclusion criterion:
NYHA III-IV heart function, or severe hepatic or renal insufficiency (Grade 4);

Annotated entities:
- Measurement: "NYHA"
- Value: "III-IV"
- Condition: "heart function"
- Qualifier: "severe"
- Condition: "hepatic insufficiency"
- Condition: "renal insufficiency"
- Qualifier: "Grade 4"